Age 18 to 45 years Irregular menstruation (> 35 days) or secondary amenorrhea> 3 months

The above is a clinical trial inclusion criterion. Annotated with entity spans:
[Line: Age 18 to 45 years] [Line: Irregular menstruation (> 35 days) or secondary amenorrhea> 3 months]